Clinical trial inclusion criterion:
Subject has inadequate tissue coverage over the operative site.

Annotated entities:
- Condition: "inadequate tissue coverage"
- Qualifier: "operative site"